Clinical trial exclusion criterion:
alcoholism and drug dependence.

Annotated entities:
- Condition: "alcoholism"
- Condition: "drug dependence"